Clinical trial exclusion criterion:
7. Known history of chronic viral hepatitis

Entity relations:
- Has_temporal("viral hepatitis", "chronic")
- Has_temporal("viral hepatitis", "history")